Presence of acute fracture

The above is a clinical trial exclusion criterion. Annotated with entity spans:
Presence of [Qualifier: acute] [Condition: fracture]